By which methods can we evaluate the reliability of a phylogenetic tree?

The methods for assessing the robustness/reliability of the topology of the inferred phylogenetic trees are: the widely used bootstrap method and the jackknife method.